Sjögren's syndrome病人最有可能出現那一種腫瘤？
A. thymoma
B. small cell carcinoma of lung
C. renal cell carcinoma
D. non-Hodgkin's lymphoma

正確答案：D. non-Hodgkin's lymphoma